Which database contains gene expression data for yeast?

The MOPED database (http://arep.med.har. Edu/ expressDB) provides access to extensive gene expression data from yeast genomes.